Clinical trial exclusion criterion:
BMI < 20

Entity relations:
- Has_value("BMI", "< 20")